Wearing off phenomenon

The above is a clinical trial inclusion criterion. Annotated with entity spans:
[Condition: Wearing off phenomenon]